下列何者可直接促進血塊形成（clot formation）？
A. thrombin使fibrinogen→fibrin
B. plasminogen→plasmin
C. tissue factor活化factor XII
D. Ca2+和factor IXa活化factor V

正確答案：A. thrombin使fibrinogen→fibrin